Primary total hip arthroplasty (THA)

The above is a clinical trial inclusion criterion. Annotated with entity spans:
[Qualifier: Primary] [Condition: total hip arthroplasty] ([Condition: THA])